神經傳遞之所以具有方向性是因為：
A. 離子通道（ion channel）蛋白發生去敏作用（desensitization）
B. 離子通道蛋白具有專一性（specificity）
C. 鈣離子在神經細胞中具方向性之傳遞
D. 鈣調素（calmodulin）在神經細胞中具方向性之傳遞

正確答案：A. 離子通道（ion channel）蛋白發生去敏作用（desensitization）